El principal factor de crecimiento autocrino para la mayoría de linfocitos T tras el reconocimiento del antígeno es:
1. La interleucina 2.
2. La interleucina 4.
3. La interleucina 10.
4. El TGF- beta.
5. Todos los anteriores.

Respuesta correcta: 1. La interleucina 2.